Clinical trial exclusion criterion:
Primary neurological disorder, including but not limited to dementia, stroke, brain tumors, epilepsy, Parkinson's disease, or demyelinating diseases

Annotated entities:
- Condition: "Primary neurological disorder"
- Condition: "dementia"
- Condition: "stroke"
- Condition: "brain tumors"
- Condition: "epilepsy"
- Condition: "Parkinson's disease"
- Condition: "demyelinating diseases"